Clinically significant abnormalities of glucose metabolism

The above is a clinical trial exclusion criterion. Annotated with entity spans:
[Qualifier: Clinically significant] [Condition: abnormalities of glucose metabolism]